Which transcription factor regulates emergency granulopoiesis?

Differentiation and proliferation of hematopoietic stem cells are regulated by C/EBPβ, a transcription factor required for emergency granulopoiesis. Granulopoiesis during emergency situations, such as infection, is dependent on C/EBPβ.